肺部因食用不明藥物引起慢性間質性肺病，導致肺容量及肺餘容積變小，氣體交換能力降低，形成慢性纖維化之蜂巢狀肺。其造成的後續影響最不可能為下列何者？
A. 右心室肥大
B. 肺高血壓
C. 肺彈性降低
D. 肺氣腫

正確答案：D. 肺氣腫